40歲男性，約一週前於雙下肢出現多發性隆起性紫斑（palpable purpura），同時伴有灼熱及疼痛感，下列何種檢查有助於診斷？
A. diascopy
B. Nikolsky sign
C. Tzanck smear
D. Darier's sign

正確答案：A. diascopy